Distal biliary obstruction consistent with pancreatic cancer, distal CBD cholangiocarcinoma or other periampullary malignancy

The above is a clinical trial inclusion criterion. Annotated with entity spans:
[Condition: Distal biliary obstruction] consistent with [Condition: pancreatic cancer], [Condition: distal CBD cholangiocarcinoma] or [Qualifier: other] [Condition: periampullary malignancy]